Clinical trial inclusion criterion:
Stage 3 - 5 Chronic Kidney Disease

Annotated entities:
- Condition: "Chronic Kidney Disease"
- Measurement: "Stage"
- Value: "3 - 5"